8歲的小明，主述2天以來有肚子痛及左踝關節疼痛腫脹，身體檢查時發現下肢有許多紫斑（purpura），下列敘述何者錯誤？
A. 25～50%的此類病人會影響腎臟
B. 血液中之血小板數目正常
C. 若有嚴重腸胃症狀如出血或阻塞，可使用類固醇治療
D. 急性期有尿液檢查異常者，建議尿液檢查追蹤2個月即可

正確答案：D. 急性期有尿液檢查異常者，建議尿液檢查追蹤2個月即可